3歲男童因過度肥胖而就診，出生時的基本新生兒篩檢無異常，亦無新生兒低張力的過去病史。家族史無特殊肥胖體質。身體診察發現手腳皆有軸後多指（趾）症（post-axial polydactyly）、外生殖器短小發育不良、眼 底呈現色素病變，此男童最有可能患有下列何種疾病？
A. Bardet-Biedl syndrome
B. Noonan syndrome
C. Prader-Willi syndrome
D. Williams syndrome

正確答案：A. Bardet-Biedl syndrome